Subjects under 18 years of age

The above is a clinical trial exclusion criterion. Annotated with entity spans:
Subjects [Value: under 18 years] of [Person: age]